Clinical trial exclusion criterion:
neurological history or

Annotated entities:
- Temporal: "neurological history"